Solo uno de los siguientes tipos celulares sintetiza la interleucina IL-12; ¿cuál?:
1. Linfocitos T citotóxicos.
2. Células NK.
3. Células dendríticas mieloides.
4. Linfocitos T helper.
5. Células endoteliales.

Respuesta correcta: 3. Células dendríticas mieloides.